Clinical trial inclusion criterion:
Seeking treatment for Alcohol Use Disorder

Annotated entities:
- Condition: "Alcohol Use Disorder"
- Procedure: "treatment"
- Mood: "Seeking"